李先生三年前因行動緩慢，面容僵硬，在某醫學中心服藥治療，每餐一顆，一天三次，有不錯的療效。但最近突發全身僵硬，無法移動，持續約一個半小時。他再去請教醫師，醫師把藥量變成每次半 顆，每天四次，這種全身僵硬的情況獲得改善。請推論李先生的疾病和用藥，下列何者最為正確？
A. 帕金森氏症（Parkinson's disease）及 L-dopa
B. 本耐狄克氏徵候群（Benedikt's syndrome）及 Aspirin
C. 傑克遜氏發作（Jacksonian seizure）及 phenytoin
D. 紀蘭巴雷徵候群（Guillain-Barré syndrome）及Vitamin B1

正確答案：A. 帕金森氏症（Parkinson's disease）及 L-dopa